Joven de 24 años que a los 3 días de un contacto sexual de riesgo presenta numerosas lesiones pustulosas, pequeñas, muy pruriginosas y que evolucionan a diminutas erosiones afectando todo el glande y cara interna del prepucio. Señale cuál es, entre las siguientes, la orientación diagnóstica más probable:
1. Candidiasis genital.
2. Chancroide.
3. Sífilis secundaria.
4. Balanitis por Tricomonas.
5. Infección fúngica por dermatofitos.

Respuesta correcta: 1. Candidiasis genital.